Clinical trial exclusion criterion:
Previously enrolled

Annotated entities:
- Competing_trial: "Previously enrolled"